Clinical trial inclusion criterion:
TBUT > 5 sec. and < 10 sec.

Annotated entities:
- Measurement: "TBUT"
- Value: "> 5 sec. and < 10 sec"